Use of medication such as oral glucocorticoids, anti-estrogens or other medications that are known to markedly influence insulin sensitivity.

The above is a clinical trial exclusion criterion. Annotated with entity spans:
Use of medication such as [Drug: oral glucocorticoids], [Drug: anti-estrogens] or [Qualifier: other] [Drug: medications] that are known to [Qualifier: markedly influence insulin sensitivity].